Hepatitis B surface antigen (HBsAg) positive and <1000 IU/mL.

The above is a clinical trial inclusion criterion. Annotated with entity spans:
[Measurement: Hepatitis B surface antigen] ([Measurement: HBsAg]) [Value: positive] and [Value: <1000 IU/mL].